下列那一個胺基酸不會吸收波長為 280 nm 的紫外光，因此對蛋白質的莫耳吸光係數（molar extinction coefficient）貢獻很小？
A. 苯丙胺酸（phenylalanine）
B. 天冬醯胺（asparagine）
C. 酪胺酸（tyrosine）
D. 色胺酸（tryptophan）

正確答案：B. 天冬醯胺（asparagine）